Clinical trial exclusion criterion:
Deglutition's problems

Annotated entities:
- Condition: "Deglutition's problems"